Clinical trial inclusion criterion:
Screening Hamilton Depression Rating Scale (HAMD) = 18; and Baseline HAMD = 15.

Entity relations:
- Subsumes("Screening Hamilton Depression Rating Scale", "HAMD")
- Has_value("HAMD", "= 15")
- Has_qualifier("HAMD", "Baseline")
- Has_value("Screening Hamilton Depression Rating Scale", "= 18")